關於眼角膜構造，下列何者錯誤？
A. 角膜本身無血管亦無神經組織
B. 角膜內皮細胞負責排除間質內過多的水分，以維持角膜正常的含水量
C. 角膜是一透明的構造，負責眼球屈光度數的一部分
D. 角膜上皮細胞的氧氣來源主要是靠淚液

正確答案：A. 角膜本身無血管亦無神經組織